Patients with elective cesarean sections

The above is a clinical trial inclusion criterion. Annotated with entity spans:
Patients with [Qualifier: elective] [Procedure: cesarean sections]